Clinical trial inclusion criterion:
planned decompression surgery with autologous stem cell transplant

Entity relations:
- AND("decompression surgery", "autologous stem cell transplant")
- Has_mood("decompression surgery", "planned")